Clinical trial exclusion criterion:
Need emergency surgery

Annotated entities:
- Mood: "Need"
- Procedure: "emergency surgery"